13. Willing to provide adequate locator information for study retention purposes and be reachable per local standard procedures

The above is a clinical trial inclusion criterion. Annotated with entity spans:
13. [Post-eligibility: Willing to provide adequate locator information for study retention purposes and be reachable per local standard procedures]